Clinical trial exclusion criterion:
Known allergy to skin patch

Entity relations:
- AND("allergy", "skin patch")